Known hypersensitivity to LDV/SOF

The above is a clinical trial exclusion criterion. Annotated with entity spans:
Known [Condition: hypersensitivity] to [Drug: LDV]/[Drug: SOF]